Clinical trial exclusion criterion:
child took any antihistamine in the past three days [including diphenhydramine (Benadryl®), cetirizine (Zyrtec®), loratadine (Claritin®), fexofenadine (Allegra®), levocetirizine (Xyzal®), and desloratadine (Clarinex®)] or

Entity relations:
- Subsumes("diphenhydramine", "Benadryl")
- Subsumes("cetirizine", "Zyrtec")
- Subsumes("loratadine", "Claritin")
- Subsumes("fexofenadine", "Allegra")
- Subsumes("levocetirizine", "Xyzal")
- Subsumes("desloratadine", "Clarinex")
- Has_temporal("antihistamine", "in the past three days")
- Subsumes("antihistamine", "diphenhydramine")
- OR("diphenhydramine", "cetirizine", "loratadine", "fexofenadine", "levocetirizine", "desloratadine")